Heart attack within the last six months or progressive coronary artery disease,

The above is a clinical trial exclusion criterion. Annotated with entity spans:
[Condition: Heart attack] [Temporal: within the last six months] or [Condition: progressive coronary artery disease],